health medical history

The above is a clinical trial inclusion criterion. Annotated with entity spans:
[Qualifier: health] [Temporal: medical history]